實施產前遺傳診斷的羊膜腔穿刺（amniocentesis）常見的時間是在懷孕的第幾週（gestational age）？
A. 第 10~13 週
B. 第 14~20 週
C. 第 21~24 週
D. 第 25~30 週

正確答案：B. 第 14~20 週